Clinical trial exclusion criterion:
regular use of tobacco products

Entity relations:
- Has_multiplier("use of tobacco products", "regular")